Diagnosis of gestational trophoblastic disease

The above is a clinical trial exclusion criterion. Annotated with entity spans:
Diagnosis of [Condition: gestational trophoblastic disease]